成年人（adult）小腸阻塞（small bowel obstruction）最常見的原因是：
A. 手術後沾黏（adhesions）
B. 疝氣（hernia）
C. 小腸腫瘤（tumor）
D. 腸套疊（intussusception）

正確答案：A. 手術後沾黏（adhesions）